下列有關 Adrenogenital syndrome 之敘述，何者錯誤？
A. C21 hydroxylation defect
B. C11 hydroxylation defect
C. ACTH 釋放增加
D. 血清中 17-ketosteroids 濃度減少

正確答案：D. 血清中 17-ketosteroids 濃度減少